下列那一種口服降血糖藥物可能引起鬱血性心臟衰竭？
A. Metformin
B. Acarbose
C. Rosiglitazone
D. Glibenclamide

正確答案：C. Rosiglitazone